下列何者是 Zollinger-Ellison 氏症候群的重要病變？
A. 高血壓
B. 高血糖
C. 肝昏迷
D. 消化性潰瘍

正確答案：D. 消化性潰瘍